Clinical trial inclusion criterion:
ACT score <20 at screening visit.

Entity relations:
- Has_value("ACT score", "<20")